Clinical trial exclusion criterion:
history of chronic pain or regular (at least once daily) opioid use preoperatively

Annotated entities:
- Condition: "chronic pain"
- Drug: "opioid"
- Multiplier: "at least once daily"
- Qualifier: "preoperatively"